Clinical trial exclusion criterion:
AST or ALT >350 within 6 months prior to enrollment

Annotated entities:
- Measurement: "AST"
- Measurement: "ALT"
- Value: ">350"
- Temporal: "within 6 months prior to enrollment"
- Reference_point: "enrollment"